膽鹽在那一段腸道會被再吸收，進入腸肝循環（enterohepatic circulation)？
A. 十二指腸（duodenum）
B. 空腸（jejunum）
C. 迴腸（ileum）
D. 結腸（colon）

正確答案：C. 迴腸（ileum）